Clinical trial inclusion criteria:
Age: > or = 16 years
Weight: more than 40 Kg
Autoimmune Hemolytic anemia with clinical and biochemical evidence of hemolysis refractory to treatment, in relapse or steroids dependant
Idiopathic thrombocytopenic purpura with platelet counts < 50,000, refractory to treatment, in relapse or steroids dependant

Annotated entities:
- Person: "Age"
- Value: "> or = 16 years"
- Measurement: "Weight"
- Value: "more than 40 Kg"
- Condition: "Autoimmune Hemolytic anemia"
- Mood: "biochemical evidence"
- Mood: "evidence clinical"
- Condition: "hemolysis"
- Qualifier: "refractory to treatment"
- Procedure: "treatment"
- Qualifier: "steroids dependant"
- Qualifier: "in relapse"
- Drug: "steroids"
- Condition: "Idiopathic thrombocytopenic purpura"
- Measurement: "platelet counts"
- Value: "< 50,000"
- Qualifier: "refractory to treatment"
- Drug: "treatment"
- Qualifier: "in relapse"
- Qualifier: "steroids dependant"
- Drug: "steroids"